Clinical trial exclusion criterion:
Co-infection with human immunodeficiency virus, hepatitis C virus, or hepatitis D virus

Entity relations:
- OR("human immunodeficiency virus", "hepatitis D virus", "hepatitis C virus")